60歲之男性，抽菸數十年，平均一天一包以上。有一年多聲音沙啞的病史。近1至2週有呼吸困難的症狀。內科醫師證實無心臟或肺部的疾病，他最有可能患下列那種病？
A. 喉腫瘤
B. 聲帶息肉
C. 甲狀腺腫瘤
D. 氣道異物

正確答案：A. 喉腫瘤